Clinical trial exclusion criterion:
Concurrent severe medical problems unrelated to the malignancy which would limit full compliance with the study.

Entity relations:
- Has_qualifier("medical problems", "severe")
- Has_temporal("medical problems", "Concurrent")
- Has_qualifier("medical problems", "limit full compliance with the study")
- multi("unrelated to the malignancy", "malignancy")
- Has_qualifier("medical problems", "unrelated to the malignancy")